下列有關視神經盤（optic disc）的敘述，何者錯誤？
A. 視神經盤和黃斑（macula densa）是視網膜（retina）上兩個不同的構造
B. 視神經盤富含光感受器（photoreceptor）
C. 視神經盤為視神經（optic nerve）聚集處
D. 視神經盤導致視野（visual field）上的盲點（blind spot）

正確答案：B. 視神經盤富含光感受器（photoreceptor）